23. Use of investigational medications within 30 days before study entry

The above is a clinical trial exclusion criterion. Annotated with entity spans:
[Parsing_Error: 23.] Use of [Drug: investigational medications] [Temporal: within 30 days before study entry]